Kidney disease not caused by diabetes or hypertension

The above is a clinical trial exclusion criterion. Annotated with entity spans:
[Condition: Kidney disease] not caused by [Condition: diabetes] or [Condition: hypertension]